男性更年期（Male Climacterics）血中的那一種數值會上升？
A. Free testosterone
B. Sex hormone binding globulin（SHBG）
C. Dehydroepiandrosterone（DHEA）
D. Total testosterone

正確答案：B. Sex hormone binding globulin（SHBG）